Clinical trial exclusion criterion:
Allergy to any of proposed medications

Entity relations:
- AND("Allergy", "proposed medications")